Written informed consent from the patient or family representative.

The above is a clinical trial inclusion criterion. Annotated with entity spans:
[Informed_consent: Written informed consent from the patient or family representative.]